Clinical trial inclusion criterion:
Bilirubin < ULN.

Entity relations:
- Has_value("Bilirubin", "< ULN")